Clinical trial exclusion criterion:
Subject with a severe chronic or acute liver disease, history of moderate (Child-Pugh B), or severe (Child-Pugh C) hepatic impairment

Annotated entities:
- Condition: "acute liver disease"
- Qualifier: "severe"
- Condition: "chronic liver disease"
- Condition: "hepatic impairment"
- Measurement: "Child-Pugh"
- Measurement: "Child-Pugh"
- Value: "B"
- Value: "C"
- Qualifier: "moderate"
- Qualifier: "severe"
- Condition: "hepatic impairment"